Clinical trial inclusion criterion:
Informed consent given

Annotated entities:
- Informed_consent: "Informed consent given"